What are the phases of hair follicle cycle?

Hair follicle cycle phases (anagen, catagen and telogen)